Clinical trial inclusion criterion:
Male or female >40 and <70 years old.

Entity relations:
- Has_value("old", ">40 and <70 years")
- OR("Male", "female")